Clinical trial exclusion criterion:
Has a history of an infected joint prosthesis, or has received antibiotics for a suspected infection of a joint prosthesis, if that prosthesis has not been removed or replaced

Entity relations:
- AND("infected", "joint prosthesis")
- Has_temporal("infected", "history")
- AND("infection", "joint prosthesis")
- Has_mood("infection", "suspected")
- AND("antibiotics", "infection")
- OR("infected", "infection")